Clinical trial inclusion criterion:
Liver function within normal range for age

Entity relations:
- Has_value("Liver function", "within normal range for age")